下列敘述，何者錯誤？
A. 手術前應考慮停止使用抗凝血劑
B. 需要輸血時應以全血（whole blood）為優先考量
C. 手術時應做好止血
D. 貧血病人，若是其 Hb>8.0 g/dL，除非需做緊急手術，否則應以紅血球輸血（red blood cell transfusion）以外的手段來增加或恢復紅血球的量

正確答案：B. 需要輸血時應以全血（whole blood）為優先考量